Clinical trial exclusion criterion:
Clear indication for specific duration of dual anti-platelet therapy

Annotated entities:
- Procedure: "dual anti-platelet therapy"
- Condition: "Clear indication for specific duration"